6. Grade 2 or higher peripheral ischemia, except for brief (< 24 hrs) episodes of ischemia managed non-surgically and without permanent deficit.

The above is a clinical trial exclusion criterion. Annotated with entity spans:
[Parsing_Error: 6.] [Qualifier: Grade 2 or higher] [Condition: peripheral ischemia], [Negation: except] for [Temporal: brief] ([Value: < 24 hrs]) episodes of [Condition: ischemia] managed [Negation: non]-[Procedure: surgically] and [Negation: without] [Condition: permanent deficit].